7. History of significant urogenital or uterine prolapse, undiagnosed vaginal bleeding, urethral obstruction

The above is a clinical trial exclusion criterion. Annotated with entity spans:
7. [Temporal: History] of [Qualifier: significant] [Condition: urogenital] or [Condition: uterine prolapse], [Qualifier: undiagnosed] [Condition: vaginal bleeding], [Condition: urethral obstruction]